誤食蠟桿菌（Bacillus cereus）污染的食物，會引起胃腸炎，主因是此菌分泌的二種腸毒素（enterotoxin）所致，其一是對熱不安定，會引起腹瀉，此腸毒素之作用機轉為何？
A. 抑制宿主細胞蛋白質合成
B. 抑制乙醯膽鹼的釋放，阻斷周邊膽鹼性神經突的神經傳遞
C. 干擾宿主細胞離子之通透性，造成細胞脫水
D. 分解宿主細胞之核糖體，阻斷酵素合成

正確答案：C. 干擾宿主細胞離子之通透性，造成細胞脫水